Clinical trial inclusion criteria:
Males and females aged between 18 to 75 years.
Adult patient under guardianship with consent obtained and the legal guardian's authorisation obtained.
Single stroke having occurred more than 6 months before (previous TIA is accepted).
Capable of understanding instructions and participating in the definition of a therapeutic goal (Boston Diagnostic Aphasia Examination (BDAE) < 3).
Having previously undergone BTI. The last injection must have been performed at least 4 months prior to inclusion.
Affiliation to the French social security regime or a similar regime.
Patient (or the legal guardian if under guardian adult patient) has signed the informed consent form.

Annotated entities:
- Person: "Males"
- Person: "females"
- Person: "aged"
- Value: "between 18 to 75 years"
- Informed_consent: "Adult patient under guardianship with consent obtained and the legal guardian's authorisation obtained"
- Condition: "stroke"
- Multiplier: "Single"
- Temporal: "more than 6 months"
- Condition: "TIA"
- Post-eligibility: "Capable of understanding instructions and participating in the definition of a therapeutic goal"
- Measurement: "Boston Diagnostic Aphasia Examination"
- Measurement: "BDAE"
- Value: "< 3"
- Procedure: "BTI"
- Procedure: "injection"
- Temporal: "at least 4 months prior to inclusion"
- Reference_point: "inclusion"
- Non-query-able: "Affiliation to the French social security regime or a similar regime"
- Informed_consent: "Patient (or the legal guardian if under guardian adult patient) has signed the informed consent form"